Uno de los siguientes compuestos, tras exposición crónica, produce daño renal como efecto tóxico principal:
1. Metilmercurio.
2. Cadmio.
3. Acetona.
4. Benceno.

Respuesta correcta: 2. Cadmio.